Clinical trial inclusion criterion:
1. Justification: Subjects must be able to perform a cognitively challenging task to a high standard.

Annotated entities:
- Parsing_Error: "1."
- Not_a_criteria: "Justification: Subjects must be able to perform a cognitively challenging task to a high standard."